Clinical trial exclusion criterion:
Consumption or injection of insulin

Entity relations:
- AND("injection", "insulin")
- OR("insulin", "insulin")